下列何者是交通性水腦症（communicating hydrocephalus）阻塞的部位？
A. 腦室間孔（interventricular foramen）
B. 大腦導水管（cerebral aqueduct）
C. 第四腦室側孔（lateral aperture）
D. 蜘蛛膜顆粒（arachnoid granulation）

正確答案：D. 蜘蛛膜顆粒（arachnoid granulation）